Clinical trial exclusion criterion:
Need for anterior surgery or for vertebral column resection.

Annotated entities:
- Procedure: "anterior surgery"
- Mood: "Need for"
- Procedure: "vertebral column resection"